Which proteins are markers of myositis?

Blood tests showed significantly increased CK and aldolase values in patients with myositis (p < 0.001 and p < 0.0001).